Clinical trial exclusion criterion:
Women who are pregnant, nursing, or of child-bearing potential who are unwilling to use appropriate method(s) of contraception.

Annotated entities:
- Pregnancy_considerations: "Women who are pregnant, nursing, or of child-bearing potential who are unwilling to use appropriate method(s) of contraception."